Clinical trial inclusion criterion:
Undergoing Assisted Reproductive Technique (ART) and oocyte maturation by human chorionic gonadotropin (HCG) triggering

Entity relations:
- AND("oocyte maturation", "human chorionic gonadotropin (HCG) triggering")
- Has_temporal("Assisted Reproductive Technique (ART)", "Undergoing")
- Has_temporal("oocyte maturation", "Undergoing")